Clinical trial exclusion criterion:
Resting heart rate <60 beat per minute (bpm).

Annotated entities:
- Measurement: "heart rate"
- Qualifier: "Resting"
- Value: "<60 beat per minute"
- Value: "<60 bpm"